一旦感染下列何種病毒，可以及早利用接種疫苗的方式來預防病毒在體內擴散而發病？
A. 玻納病毒（Borna disease virus）
B. 狂犬病毒（Rabies virus）
C. 線狀病毒（Filovirus）
D. 馬堡病毒（Marburg virus）

正確答案：B. 狂犬病毒（Rabies virus）